Clinical trial exclusion criterion:
chromosomal abnormality

Annotated entities:
- Condition: "chromosomal abnormality"